Patients with a personal or family history of medullary thyroid carcinoma or patients with Multiple Endocrine Neoplasia syndrome type 2

The above is a clinical trial exclusion criterion. Annotated with entity spans:
Patients with a [Temporal: personal] or [Observation: family history] of [Condition: medullary thyroid carcinoma] or patients with [Condition: Multiple Endocrine Neoplasia syndrome type 2]